Clinical trial inclusion criterion:
Patients scheduled for thyroidectomy with general anesthesia in the University of Chile Clinical Hospital

Annotated entities:
- Mood: "scheduled for"
- Procedure: "thyroidectomy"
- Procedure: "general anesthesia"
- Visit: "University of Chile Clinical Hospita"